Clinical trial inclusion criterion:
Age > 18 years and < 90 years

Entity relations:
- Has_value("Age", "> 18 years")
- Has_value("Age", "< 90 years")